Secondary anxiety disorders

The above is a clinical trial exclusion criterion. Annotated with entity spans:
[Condition: Secondary anxiety disorders]